Clinical trial exclusion criteria:
Person is under 18 years of age.
Person who weighs more than 136kg.
Person who weighs less than 50kg.
Person who is pregnant.
Person has a history of chronic skin breakdown on the residual limb.
Person has conditions that would prevent participation and pose increased risk (e.g. unstable cardiovascular conditions that preclude physical activity such as walking).
Person falls = once a week due to the reasons that could not be corrected by the new prosthesis (for ex. problems with vestibular system).
Person is using under arm axillary crutches or walker.
Person in an emergency, life threatening situation.
Person is unwilling/unable to follow instructions.
Person who is not available to follow the entire study protocol.
Person who is participating in another study or intends to participate in another study during this study duration.
Person who cannot personally provide their consent.
Person who is not wearing prosthesis 8hours/day on average.
Person who has a score on 10m walk test less than 3km/h (~0.8m/s) (based on 10m walk test conducted during recruiting).
Person who walks on average less than 1km per day.
Person who is not able to walk on level ground in a step over step manner.

Annotated entities:
- Person: "age"
- Value: "under 18 years"
- Person: "weighs"
- Value: "more than 136kg"
- Person: "weighs"
- Value: "less than 50kg"
- Condition: "pregnant"
- Condition: "skin breakdown"
- Qualifier: "chronic"
- Qualifier: "residual limb"
- Non-query-able: "Person has conditions that would prevent participation and pose increased risk (e.g. unstable cardiovascular conditions that preclude physical activity such as walking)."
- Observation: "falls"
- Multiplier: "once a week"
- Non-query-able: "Person falls = once a week due to the reasons that could not be corrected by the new prosthesis (for ex. problems with vestibular system)"
- Device: "under arm axillary crutches"
- Device: "walker"
- Observation: "life threatening situation"
- Observation: "emergency situation"
- Post-eligibility: "Person is unwilling/unable to follow instruction"
- Post-eligibility: "Person who is not available to follow the entire study protocol"
- Competing_trial: "Person who is participating in another study or intends to participate in another study during this study duration."
- Informed_consent: "Person who cannot personally provide their consent"
- Negation: "not"
- Device: "prosthesis"
- Multiplier: "8hours/day"
- Measurement: "10m walk test"
- Value: "less than 3km/h"
- Value: "0.8m/s)"
- Observation: "walks"
- Multiplier: "ess than 1km per day"
- Non-query-able: "Person who is not able to walk on level ground in a step over step manner"